Which receptors can be evaluated with the [18F]altanserin?

5-HT2A (5-hydroxytryptamine type 2a) receptor can be evaluated with the [18F]altanserin.